Clinical trial exclusion criterion:
Leg ulcerations or infections in the foot.

Annotated entities:
- Condition: "Leg ulcerations"
- Condition: "infections in the foot"